El corrector Zeeman:
1. Se emplea ampliamente en Fluorescencia Molecular para corregir el efecto de filtro interno.
2. Es un corrector de fondo en espectrometría de absorción atómica, que se basa en la propiedad que tienen los átomos en forma de vapor atómico de desdoblar sus niveles de energía electrónicos al ser sometidos a un campo magnético intenso, originándose diversas líneas de emisión para cada transición electrónica.
3. Se basa en el fenómeno de autoabsorción que se produce cuando la lámpara de cátodo hueco se somete a corrientes elevadas y se emplea ampliamente en espectrometría de absorción atómica.
4. Se basa en la emisión de radiación continua en la región ultravioleta de una lámpara de deuterio, empleada como corrector de fondo.
5. Es un corrector de interferencias químicas, ampliamente utilizado en espectrometría de emisión atómica.

Respuesta correcta: 2. Es un corrector de fondo en espectrometría de absorción atómica, que se basa en la propiedad que tienen los átomos en forma de vapor atómico de desdoblar sus niveles de energía electrónicos al ser sometidos a un campo magnético intenso, originándose diversas líneas de emisión para cada transición electrónica.